Clinical trial inclusion criterion:
Patients with a confirmed diagnosis of:

Annotated entities:
- Parsing_Error: "atients with a confirmed diagnosis of:"